Clinical trial inclusion criterion:
Suspected coronary artery disease who are supposed to undergo invasive coronary angiography with appropriate clinical indications

Entity relations:
- Has_mood("coronary artery disease", "Suspected")
- Has_mood("invasive coronary angiography", "supposed to undergo")